Clinical trial exclusion criterion:
evidence of arthritis on x-ray,

Annotated entities:
- Mood: "evidence of"
- Condition: "arthritis"
- Procedure: "x-ray"